Study eye with clinically significant diabetic macular edema (DME) with central subfield thickness ≥ 350µm on spectral domain OCT

The above is a clinical trial inclusion criterion. Annotated with entity spans:
Study eye with [Qualifier: clinically significant] [Condition: diabetic macular edema (DME)] with [Measurement: central subfield thickness] [Value: ≥ 350µm] on [Procedure: spectral domain OCT]